Clinical trial inclusion criterion:
intact preoperative erectile function with an IIEF = 21 (IIEF-6).

Entity relations:
- Has_temporal("intact erectile function", "preoperative")
- Has_value("IIEF", "= 21")
- Subsumes("IIEF", "IIEF-6")
- AND("intact erectile function", "IIEF")